Treatment with anticholinergic medication in the last 2 months

The above is a clinical trial exclusion criterion. Annotated with entity spans:
Treatment with [Drug: anticholinergic medication] in the [Temporal: last 2 month]s